37 weeks gestation or greater

The above is a clinical trial inclusion criterion. Annotated with entity spans:
[Value: 37 weeks] [Condition: gestation] or greater